Patients must be registered in a social security system or with a health insurance coverage

The above is a clinical trial inclusion criterion. Annotated with entity spans:
Patients must be [Observation: registered in a social security system] or with a [Observation: health insurance coverage]